Patients who'd had previous gastric surgery

The above is a clinical trial exclusion criterion. Annotated with entity spans:
Patients who'd had [Temporal: previous] [Procedure: gastric surgery]